Clinical trial exclusion criterion:
Presence of any systemic disease that could alter the production or composition of saliva.

Annotated entities:
- Condition: "systemic disease"
- Qualifier: "could alter the production or composition of saliva"